Clinical trial inclusion criterion:
Fluent in English;

Annotated entities:
- Non-query-able: "Fluent in English;"